Clinical trial inclusion criterion:
Diagnosis of functional dyspepsia, based on the Rome IV criteria (2016).

Entity relations:
- AND("Rome IV criteria (2016)", "functional dyspepsia")